Augmentation of labor (latent or active phase)

The above is a clinical trial exclusion criterion. Annotated with entity spans:
[Condition: Augmentation of labor] ([Qualifier: latent] or [Qualifier: active phase])